Person is a K2, K3 or K4 ambulator based on Medicare Functional Classification Level (MFCL).

The above is a clinical trial inclusion criterion. Annotated with entity spans:
Person is a [Value: K2, K3 or K4] ambulator based on [Measurement: Medicare Functional Classification Level] ([Measurement: MFCL]).